Retinal diseases potentially requiring treatment during the following 3 months

The above is a clinical trial exclusion criterion. Annotated with entity spans:
[Condition: Retinal diseases] potentially [Mood: requiring] [Procedure: treatment] [Temporal: during the following 3 months]